男性不孕患者，精液檢查總活動數精蟲少於 1 百萬，實施人工協助生殖技術時，下列何項處置最有效？
A. 透明區穿孔術（zona drilling）
B. 卵質內單一精蟲注入術（intracytoplasmic sperm injection）
C. 透明區下精蟲注入（subzonal sperm injection）
D. 透明區磨薄術（assisted hatching）

正確答案：B. 卵質內單一精蟲注入術（intracytoplasmic sperm injection）